Clinical trial inclusion criterion:
Histologic diagnosis of chondrosarcoma, verifiable after enrollment

Entity relations:
- AND("chondrosarcoma", "Histologic")